Clinical trial exclusion criterion:
Left bundle branch block or ventricular pacing

Entity relations:
- OR("Left bundle branch block", "ventricular pacing")